Clinical trial inclusion criteria:
Acutely ill hospitalised children
Need for intravenous fluid therapy

Annotated entities:
- Condition: "Acutely ill"
- Observation: "hospitalised"
- Person: "children"
- Mood: "Need for"
- Procedure: "intravenous fluid therapy"